Name three binding partners of cofilin 2.

Cofilin 2 can bind miR-201a, the protein 14-3-3, and ATP/ADP-Pi-actin filaments.